Clinical trial inclusion criterion:
Be willing to attend all clinic visits

Annotated entities:
- Non-query-able: "Be willing to attend all clinic visits"